Clinical trial inclusion criterion:
Endometrial thickness = 7 mm after stimulation

Entity relations:
- Has_value("Endometrial thickness", "= 7 mm")
- multi("stimulation", "stimulation")
- AND("after stimulation", "stimulation")
- Has_temporal("Endometrial thickness", "after stimulation")
- Has_index("after stimulation", "stimulation")